李先生，45歲，患有偏頭痛（migraine），無高血壓、糖尿病病史，因腦梗塞住院。他的父親及弟弟也有腦梗塞病史，弟弟除腦梗塞外，也有失智症（dementia）。下列敘述何者最正確？
A. 腦影像檢查顯示有水腦症
B. 合併有多發性神經病變（polyneuropathy）
C. 可以做NOTCH3基因分析檢查
D. 偏頭痛為診斷此疾病之必要條件

正確答案：C. 可以做NOTCH3基因分析檢查